Clinical trial exclusion criterion:
Unstable angina

Annotated entities:
- Condition: "Unstable angina"